下列那一種傳染病最容易影響男性的睪丸，導致睪丸萎縮而不孕？
A. 水痘（chickenpox）
B. 披衣菌（Chlamydia）尿道炎
C. 腮腺炎（mumps）
D. 疱疹（herpes）

正確答案：C. 腮腺炎（mumps）